Clinical trial exclusion criteria:
History of significant head trauma, seizure disorder, or mental retardation
History of alcohol or drug abuse or dependence within 1 month prior to study entry
History of violence within 6 months prior to study entry

Annotated entities:
- Condition: "head trauma"
- Condition: "seizure disorder"
- Condition: "mental retardation"
- Temporal: "History"
- Temporal: "History"
- Condition: "abuse alcohol"
- Condition: "drug abuse"
- Condition: "dependence alcohol"
- Condition: "dependence drug"
- Temporal: "within 1 month prior"
- Temporal: "within 6 months prior"
- Observation: "violence"
- Temporal: "History"